Clinical trial inclusion criterion:
Signed informed consent

Annotated entities:
- Informed_consent: "Signed informed consent"